下列有關腹式呼吸的描述，何者有誤？
A. 即利用橫膈呼吸
B. 以口吸氣
C. 吸氣時腹部鼓起
D. 吐氣時腹肌用力

正確答案：B. 以口吸氣